下列有關腎臟與全身各器官血流分布與氧氣消耗的敘述，何者錯誤？
A. 單位腎臟重量每分鐘的血流量（mL/g/min）以腎臟皮質最大
B. 全身各器官的動靜脈氧氣差異（arteriovenous oxygen difference）以腎臟最高
C. 腎臟髓質的動脈氧氣分壓比皮質為低
D. 腎臟髓質因為腎小管細胞需要主動吸收相當量的鈉離子，所以需自血液中提取相當大量的氧氣

正確答案：B. 全身各器官的動靜脈氧氣差異（arteriovenous oxygen difference）以腎臟最高